Clinical trial exclusion criterion:
Participation in another clinical trial within 30 days of the screening visit;

Annotated entities:
- Competing_trial: "Participation in another clinical trial within 30 days of the screening visit"